Which cancer types are associated with mutations in the TWIST1 gene?

Loss-of-function mutations of TWIST1, a catalytic component of polycomb repressive complex 1, are observed in ~\n10% of all human cancers, including gastric, non-small cell lung, breast ductal carcinoma, nonsmall cell lung cancer, prostate cancer, ovarian cancer, breast tumor, papillary thyroid cancer, and gastric cancer.